Women refusing HBs Ag test

The above is a clinical trial exclusion criterion. Annotated with entity spans:
Women [Negation: refusing] [Measurement: HBs Ag test]